Clinical trial exclusion criterion:
Severe malnutrition (weight-for-height Z-score <-3)

Entity relations:
- Has_qualifier("malnutrition", "Severe")
- Has_value("weight-for-height Z-score", "<-3")
- AND("malnutrition", "weight-for-height Z-score")